Clinical trial exclusion criterion:
A1C >7.0%

Entity relations:
- Has_value("A1C", ">7.0%")